21歲女性，月經來之後兩週，突然下腹疼痛，下列何者為最有可能的原因？
A. 子宮內膜異位
B. 子宮外孕
C. 盲腸炎
D. 排卵

正確答案：D. 排卵